Clinical trial exclusion criterion:
Presence of dental prostheses.

Annotated entities:
- Device: "dental prostheses"